what is the effect of Bisphenol A in the body?

Bisphenol A is an endocrine-disruptor compound, that exhibits estrogenic activity, can affect male fertility, and can modulate the immune response to infections. It is also associated with increased risk of obesity and diabetes.